Clinical trial inclusion criterion:
Presence of intracranial aneurysm (with or without rupture)

Entity relations:
- Has_qualifier("intracranial aneurysm", "with rupture")
- OR("with rupture", "without rupture")